Clinical trial inclusion criteria:
Moderate to severe CD define as HBI score > 4.
Montreal classification: no limitation, except age> 6.

Annotated entities:
- Qualifier: "Moderate"
- Qualifier: "severe"
- Condition: "CD"
- Measurement: "HBI score"
- Value: "> 4"
- Non-representable: "Montreal classification: no limitation, except age> 6."